La utilización de microorganismos para transformar contaminantes presentes en el medio ambiente en productos no tóxicos se denomina:
1. Biodeterioro.
2. Biorremediación.
3. Biolixiviación.
4. Bioconversión.
5. Biosensor.

Respuesta correcta: 2. Biorremediación.